Clinical trial exclusion criterion:
ASA IV

Entity relations:
- Has_value("ASA", "IV")